Clinical trial exclusion criterion:
preterm birth

Annotated entities:
- Condition: "preterm birth"